Clinical trial exclusion criterion:
usual place of residence outside Seine-Saint-Denis

Annotated entities:
- Qualifier: "outside Seine-Saint-Denis"
- Observation: "place of residence"